History of hypersensitivity to vaccines.

The above is a clinical trial exclusion criterion. Annotated with entity spans:
[Temporal: History] of [Condition: hypersensitivity to vaccines].